Clinical trial exclusion criterion:
Vaccination against pneumococcal infection in anamnesis;

Entity relations:
- AND("Vaccination", "pneumococcal infection")